Clinical trial exclusion criterion:
Preexisting ocular diseases or conditions other than age related cataracts, have contraindications for cataract surgery;

Annotated entities:
- Condition: "ocular diseases"
- Temporal: "Preexisting"
- Condition: "conditions"
- Negation: "other than"
- Condition: "cataracts"
- Qualifier: "age related"
- Condition: "contraindications"
- Procedure: "cataract surgery"